immediate sub-pectoral prosthetic reconstruction;

The above is a clinical trial inclusion criterion. Annotated with entity spans:
[Qualifier: immediate] [Procedure: sub-pectoral prosthetic reconstruction];